4. Past diagnosis of major depression, schizophrenia, major anxiety syndrome, or manic- depressive illness.

The above is a clinical trial exclusion criterion. Annotated with entity spans:
[Parsing_Error: 4.] [Observation: Past diagnosis] of [Condition: major depression], [Condition: schizophrenia], [Condition: major anxiety syndrome], or [Condition: manic- depressive illness].